Epileptic status

The above is a clinical trial exclusion criterion. Annotated with entity spans:
[Condition: Epileptic status]